Patients allergic to polyglycolic / trimethylene carbonate

The above is a clinical trial exclusion criterion. Annotated with entity spans:
Patients [Condition: allergic] to [Drug: polyglycolic] / [Drug: trimethylene carbonate]